Estimated glomerular filtration rate (eGFR by MDRD) =20 mL/min per 1.73 m2 or serum creatinine >300 micromol/L (3.39 mg/dL) at screening.

The above is a clinical trial exclusion criterion. Annotated with entity spans:
[Measurement: Estimated glomerular filtration rate] ([Measurement: eGFR] by MDRD) [Value: =20 mL/min per 1.73 m2] or [Measurement: serum creatinine] [Value: >300 micromol/L] ([Value: 3.39 mg/dL]) at screening.